El enlace fosfodiéster:
1. Se forma por ataque de una base nitrogenada a un fosfato.
2. Se forma empleando como sustrato NMP.
3. En su formación se consume PPi.
4. Implica a un fosfato alfa de un nucleótido y a un grupo OH de la ribosa de otro.
5. No necesita catálisis enzimática.

Respuesta correcta: 4. Implica a un fosfato alfa de un nucleótido y a un grupo OH de la ribosa de otro.